Clinical trial exclusion criterion:
History of pancreatitis

Entity relations:
- Has_temporal("pancreatitis", "History")